Mujer de 46 años con antecedentes de valvulopatía reumática, que precisa sustitución valvular mitral por una prótesis mecánica. La evolución postoperatoria inicial es favorable. Sin embargo, tras comenzar tratamiento con acenocumarol desarrolla un cuadro de necrosis cutánea afectando región abdominal y extremidades. ¿Cuál de las siguientes alteraciones justificaría este cuadro?
1. Deficiencia de antitrombina.
2. Factor V Leiden.
3. Hiperhomocisteinemia.
4. Deficiencia de proteína C.

Respuesta correcta: 4. Deficiencia de proteína C.